Clinical trial exclusion criterion:
Pregnant or breastfeeding women.

Annotated entities:
- Pregnancy_considerations: "Pregnant or breastfeeding women"